Clinical trial exclusion criterion:
Renal failure (eGFR <30 or requiring dialysis)

Annotated entities:
- Condition: "Renal failure"
- Measurement: "eGFR"
- Value: "<30"
- Mood: "requiring"
- Procedure: "dialysis"